living at home in the community;

The above is a clinical trial inclusion criterion. Annotated with entity spans:
[Observation: living at home in the community];